Clinical trial exclusion criterion:
Aspirin, ticagrelor or clopidogrel allergies;

Annotated entities:
- Drug: "Aspirin"
- Drug: "ticagrelor"
- Drug: "clopidogrel"
- Condition: "allergies"